El agente causante de la sífilis:
1. Pertenece al género Spirochaeta.
2. Tiene flagelos periplasmáticos (endoflagelos).
3. Es aerobico estricto.
4. Tiene un flagelo polar.

Respuesta correcta: 2. Tiene flagelos periplasmáticos (endoflagelos).